Clinical trial inclusion criterion:
Minimum of 12 natural teeth

Entity relations:
- Has_multiplier("natural teeth", "Minimum of 12")